What is the effect of rHDL-apoE3 on endothelial cell migration?

rHDL-apoE3 has been shown to promote endothelial cell migration.